Clinical trial inclusion criterion:
Venous incompetence confirmed by clinical assessment and duplex ultrasound scan

Entity relations:
- AND("clinical assessment", "Venous incompetence")
- AND("duplex ultrasound scan", "Venous incompetence")